Cuando aparecen criterios para el diagnóstico de un tipo de fobia en la que se da miedo a situaciones como transportes públicos, túneles, puentes, ascensores, aviones, coches o recintos cerrados, teniendo un pico de mayor incidencia en la segunda infancia y otro a mitad de la tercera década de la vida, podemos pensar en ¿qué diagnóstico del DSM-IV-TR?
1. Fobia social.
2. Fobia específica situacional.
3. Fobia específica tipo ambiental.
4. Ansiedad de separación.
5. Crisis de angustia.

Respuesta correcta: 2. Fobia específica situacional.